P. C. es un enfermo en situación terminal que presenta mucositis oral y dolor, aunque conserva la capacidad para comer una dieta sólida. ¿Cuál de las siguientes acciones estaría indicada?
1. Animarle a chupar trocitos de piña.
2. Enjuagar la boca con ¾ partes de suero salino 0,9% y ¼ parte de agua oxigenada.
3. Hacer gargarismos con nistatina alternando con clorhexidina.
4. Administrar lidocaína viscosa al 2% antes de las comidas.
5. Proporcionar una dieta túrmix.

Respuesta correcta: 4. Administrar lidocaína viscosa al 2% antes de las comidas.